Contraindication to the study medication.

The above is a clinical trial exclusion criterion. Annotated with entity spans:
[Condition: Contraindication] to the [Drug: study medication].